Clinical trial exclusion criterion:
Age under 18 years

Annotated entities:
- Person: "Age"
- Value: "under 18 years"